polycystic ovaries

The above is a clinical trial exclusion criterion. Annotated with entity spans:
[Condition: polycystic ovaries]